El enlace glucosídico en los disacáridos se caracteriza por:
1. Implicar al menos a un carbono anomérico.
2. Tener configuración beta en la maltosa.
3. Ser un enlace N-glucosídico.
4. Presentar carga.

Respuesta correcta: 1. Implicar al menos a un carbono anomérico.